Which proteins are controlling sterol metabolism in S. cerevisiae?

The yeast genome encodes seven oxysterol binding protein homologs, Osh1p-Osh7p, which have been implicated in regulating intracellular lipid and vesicular transport northern blot analysis showed that increased binding correlates with increased expression for the analyzed Upc2p included 12 genes involved in ergosterol biosynthesis  to better understand Upc2p function in C. albicans, we used genomewide location profiling to identify the transcriptional targets of Upc2p in vivo. Upc2p, a transcription factor of the zinc cluster family, is an important regulator of sterol biosynthesis and azole drug resistance in Candida albicans sterol metabolism and ERG2 gene regulation in the yeast Saccharomyces cerevisiae. They also suggest that Upc2p may contribute to azole resistance by regulating the expression of drug efflux pump-encoding genes in addition to ergosterol metabolism. Overrepresented functional groups of genes whose promoters were bound by Upc2p is a key regulator of ergosterol metabolism. We have taken advantage of this property to study the regulation of the Delta8-Delta7-sterol isomerase-encoding ERG2 gene in an ergosterol auxotrophic mutant devoid of squalene-synthase activity. Ergosterol starvation leads to an 8-16-fold increase in ERG2 gene expression.